Podemos considerar un antecedente de la evaluación dinámica cognitiva la obra de :
1. Thorndike (1974-1949).
2. Binet (1927).
3. Vygostsky (1935).
4. Kelly (1955).
5. Weschler (1967).

Respuesta correcta: 3. Vygostsky (1935).